What is the typical alteration of the thyroid profile metabolism early after coronary artery bypass graft surgery?

Low T3 Syndrome is the more frequent alteration of thyroid hormone profile early after coronary artery bypass graft surgery.